Which is the process that Conserved noncoding elements mostly regulate?

Conserved noncoding elements play a fundamental role in regulating animal development